Suspected coronary artery disease who are supposed to undergo invasive coronary angiography with appropriate clinical indications

The above is a clinical trial inclusion criterion. Annotated with entity spans:
[Mood: Suspected] [Condition: coronary artery disease] who are [Mood: supposed to undergo] [Procedure: invasive coronary angiography] with appropriate clinical indications